Clinical trial exclusion criterion:
Previous uterine surgery.

Entity relations:
- Has_temporal("uterine surgery", "Previous")